Clinical trial exclusion criterion:
pregnancy or breastfeeding (female participants with childbearing potential were required to use medically accepted contraception for the duration of the study)

Annotated entities:
- Pregnancy_considerations: "pregnancy or breastfeeding (female participants with childbearing potential were required to use medically accepted contraception for the duration of the study)"